Clinical trial inclusion criterion:
Fasting or postprandial plasma C-peptide more than 100 pmol/L

Entity relations:
- Has_value("Fasting plasma C-peptide", "more than 100 pmol/L")
- OR("Fasting plasma C-peptide", "postprandial plasma C-peptide")